What does mTOR stands for?

mTOR stands for: mammalian target of rapamycin.